下列關於標準化死亡率比（standardized mortality ratio, SMR）之敘述，何者錯誤？
A. 病例對照法也可計算 SMR
B. 兩個 SMR 無法直接相比
C. 是一種間接法之標準化方式
D. 兩個族群 SMR 不同，必然是因分層死亡率不同

正確答案：D. 兩個族群 SMR 不同，必然是因分層死亡率不同